一週大男嬰由家長帶來就診，主訴產前檢查發現胎兒有水腎，要求進一步檢查。目前男嬰外觀及理學檢查沒有異常發現，也沒有任何症狀。下列何種處置最適當？
A. 絕大部分水腎會自行消失，所以回家觀察即可
B. 安排靜脈注射腎盂攝影（intravenous pyelography）檢查是否有尿路阻塞
C. 腎臟超音波評估水腎程度，視結果再考慮下一步處置
D. 抽血檢查腎功能，視結果再考慮下一步處置

正確答案：C. 腎臟超音波評估水腎程度，視結果再考慮下一步處置